Osteonecrosis

The above is a clinical trial inclusion criterion. Annotated with entity spans:
[Condition: Osteonecrosis]